Clinical trial inclusion criterion:
Surgical candidate per pancreatobiliary surgeon after multi-disciplinary discussion

Annotated entities:
- Condition: "Surgical candidate"
- Qualifier: "per pancreatobiliary surgeon"